Oliguria (urine output less than 400 ml per day)

The above is a clinical trial exclusion criterion. Annotated with entity spans:
[Condition: Oliguria] ([Measurement: urine output] [Value: less than 400 ml per day])